有關嬰兒幽門肥厚性狹窄（infantile hypertrophic pyloric stenosis）之敘述，下列何者正確？
A. 大多出生即出現噴射性嘔吐（projectile vomiting）
B. 嘔吐物以膽汁（bile）為主
C. 診斷主要依賴完整病史及腹部超音波檢查
D. 手術為胃空腸接合術（gastrojejunostomy）

正確答案：C. 診斷主要依賴完整病史及腹部超音波檢查